Clinical trial exclusion criterion:
history of prior colonic or rectal surgery

Annotated entities:
- Temporal: "history of"
- Temporal: "prior"
- Procedure: "colonic surgery"
- Procedure: "rectal surgery"